¿La actividad neural aferente de los nocioceptores periféricos está modulada en el asta dorsal de la médula, que actúa como una puerta que impide o no el paso de los impulsos nerviosos que proceden de los nocioceptores y del córtex, se refiere a?
1. El sistema nervioso periférico.
2. La teoría de la puerta.
3. El estrés crónico.
4. La teoría de la escalada.
5. El proceso biológico de la relajación.

Respuesta correcta: 2. La teoría de la puerta.